A 檢驗對 B 疾病之敏感性（sensitivity）與專一性（specificity）均為 80%。你將 A 檢驗應用在某一 1000 人之族群，假設該族群 B 疾病之盛行率（prevalence）為 20%，則檢查結果陽性者之陽性預測值 （positive predictive value）為何？
A. 80%
B. 50%
C. 25%
D. 15%

正確答案：B. 50%